Clinical trial exclusion criterion:
impossibility to obtain a signed consent form.

Entity relations:
- Has_context("impossibility to obtain", "signed consent form")